Clinical trial exclusion criterion:
have actively suicidal thought(Suicidal ideation score of MADRS is 6)

Annotated entities:
- Condition: "actively suicidal thought"
- Measurement: "Suicidal ideation score of MADRS"
- Value: "6"